橋本氏甲狀腺炎（Hashimoto's disease）最後會導致：
A. 甲狀腺機能亢進
B. 淋巴癌
C. 甲狀腺機能低下
D. 甲狀腺乳突癌

正確答案：C. 甲狀腺機能低下